Los factores de transcripción:
1. Se unen a la cromatina por interacción con la histona H2A.
2. Se unen al RNA y regulan el inicio de la transcripción.
3. Se unen al DNA.
4. Se organizan en nucleosomas.
5. Regulan la metilación del DNA.

Respuesta correcta: 3. Se unen al DNA.